一位40歲男性發生車禍，造成背部嚴重疼痛。胸腰椎側面X光（lateral view）發現第十一胸椎骨折，且在前 後向X光（AP view）發現其雙側椎莖距離（interpedicular distance）變寬。依照X光檢查的發現，下列何者
 是第十一胸椎的最適當診斷？
A. 爆裂性骨折（burst fracture）
B. 壓迫性骨折（compression fracture）
C. 彎曲牽開性骨折（flexion-distraction fracture）
D. 骨折脫位（fracture dislocation）

正確答案：A. 爆裂性骨折（burst fracture）